Clinical trial exclusion criterion:
3. Ingestion of any vitamins or herbal products within the 48 hours prior to the initial dose of the study medication.

Annotated entities:
- Not_a_criteria: "Ingestion of any vitamins or herbal products within the 48 hours prior to the initial dose of the study medication."
- Parsing_Error: "3."